Denial of signing the consent form.

The above is a clinical trial exclusion criterion. Annotated with entity spans:
[Negation: Denial of] [Informed_consent: signing the consent form].